臨床上對預防肺結核病仍沒有令人滿意的疫苗。關於卡介苗的敘述下列何者錯誤？
A. 是活的分枝桿菌
B. 無法引發細胞免疫反應
C. 是我國的免費例行疫苗之一
D. 施打後會增加結核菌素測	的偽陽性率

正確答案：B. 無法引發細胞免疫反應